Clinical trial exclusion criterion:
Anaemia not attributed to iron deficiency, e.g. other microcytic anaemia

Annotated entities:
- Condition: "Anaemia"
- Negation: "not"
- Drug: "iron deficiency"
- Mood: "attributed to"
- Qualifier: "other"
- Condition: "microcytic anaemia"